Clinical trial exclusion criterion:
History of severe psychiatric disease, especially depression. Severe psychiatric disease is defined as major depression or psychosis, a period of treatment with an antidepressant medication or major tranquilizer at therapeutic doses for depression or psychosis for at least 3 months, a suicidal attempt, hospitalization for psychiatric disease, or a period of disability due to a psychiatric disease.

Annotated entities:
- Condition: "psychiatric disease"
- Qualifier: "severe"
- Condition: "depression"
- Qualifier: "Severe"
- Condition: "psychiatric disease"
- Condition: "major depression"
- Condition: "psychosis"
- Procedure: "treatment"
- Drug: "antidepressant medication"
- Drug: "major tranquilizer"
- Multiplier: "therapeutic doses"
- Condition: "depression"
- Condition: "psychosis"
- Temporal: "for at least 3 months"
- Condition: "suicidal attempt"
- Procedure: "hospitalization"
- Condition: "psychiatric disease"
- Condition: "disability"
- Condition: "psychiatric disease"